Clinical trial inclusion criterion:
Patient has an IPSS score of at least 13 at baseline

Entity relations:
- Has_index("at baseline", "baseline")
- Has_value("IPSS score", "at least 13")
- Has_temporal("IPSS score", "at baseline")